¿A qué edad aproximada los niños comienzan a entender que una persona pueda tener creencias falsas sobre el mundo?:
1. A los 18 meses.
2. A los dos años.
3. A los cuatro años.
4. A los seis años.
5. A los ocho años.

Respuesta correcta: 3. A los cuatro años.